inability to give informed written consent;

The above is a clinical trial exclusion criterion. Annotated with entity spans:
[Informed_consent: inability to give informed written consent;]